下列對Okazaki片段的敘述，何者正確？
A. 由於內切酶（endonuclease）作用後所產生的DNA片段
B. 存在於30S核糖體次單元（ribosomal subunit）中的RNA片段
C. 是DNA複製時發生在合成lagging strand的中間產物
D. 意指由3'→ 5'合成的DNA片段

正確答案：C. 是DNA複製時發生在合成lagging strand的中間產物